History of heparin-induced thrombocytopenia (HIT)

The above is a clinical trial exclusion criterion. Annotated with entity spans:
[Temporal: History] of [Condition: heparin-induced thrombocytopenia (HIT)]